Systemic sclerosis meeting the EULAR criteria.

The above is a clinical trial inclusion criterion. Annotated with entity spans:
[Condition: Systemic sclerosis] [Value: meeting] the [Measurement: EULAR criteria].